Clinical trial exclusion criterion:
Psychological and / or cognitive impairments that restrict them to respond to questionnaires;

Entity relations:
- Has_qualifier("Psychological impairments", "restrict them to respond to questionnaires")
- Has_qualifier("cognitive impairments", "restrict them to respond to questionnaires")
- OR("Psychological impairments", "cognitive impairments")